La función primaria de la interleucina 2 (IL-2) es:
1. Inducir activación de macrófagos.
2. Promover cambios de isotipos en las inmunoglobulinas producidas por células B activadas.
3. Inducir la síntesis de proteínas de fase aguda por los hepatocitos.
4. Promover la proliferación de linfocitos T.
5. Promover la proliferación de linfocitos B.

Respuesta correcta: 4. Promover la proliferación de linfocitos T.